Clinical trial exclusion criterion:
Primary substance exposure in-utero was buprenorphine, or was not opioids

Annotated entities:
- Observation: "substance exposure"
- Qualifier: "in-utero"
- Qualifier: "buprenorphine"
- Negation: "not"
- Drug: "opioids"